懷疑有腦膜炎時，下列何種檢查方法對診斷的確立最重要？
A. 腦部磁振造影
B. 腦脊髓液檢查
C. 腦波檢查
D. 電腦斷層攝影

正確答案：B. 腦脊髓液檢查